Clinical trial inclusion criterion:
Hoehn and Yahr Scale score of 1 - 3

Entity relations:
- Has_value("Hoehn and Yahr Scale score", "1 - 3")